下列何者屬於非游離輻射？
A. 宇宙射線
B. X光射線（X ray）
C. 迦馬射線（Gamma ray）
D. 紅外線（infrared radiation）

正確答案：D. 紅外線（infrared radiation）